使用治療憂鬱症藥物時，經常會因為藥物同時具有阻斷組織胺（Histamine）H1 受體、毒蕈素型（Muscarinic）乙醯膽鹼受體及甲型-腎上腺素性受體（α-adrenergic receptors）而產生一些副作用，下列那一種治療憂鬱症藥物最不具有這些受體的抑制作用？
A. Mirtazapine
B. Fluoxetine
C. Amitriptyline
D. Nefazodone

正確答案：B. Fluoxetine